Weight > 220 pounds

The above is a clinical trial exclusion criterion. Annotated with entity spans:
[Measurement: Weight] [Value: > 220 pounds]